revision hip arthroplasty

The above is a clinical trial exclusion criterion. Annotated with entity spans:
[Procedure: revision hip arthroplasty]